platelets ≥ 100 x109/L

The above is a clinical trial inclusion criterion. Annotated with entity spans:
[Measurement: platelets] [Value: ≥ 100 x109/L]